Clinical trial exclusion criterion:
The patient has received chemotherapy or immunotherapy for primary tumors

Annotated entities:
- Procedure: "chemotherapy"
- Procedure: "immunotherapy"
- Condition: "primary tumors"